Clinical trial exclusion criterion:
Asthma or Chronic Obstructive pulmonary Disease

Annotated entities:
- Condition: "Asthma"
- Condition: "Chronic Obstructive pulmonary Disease"